Clinical trial exclusion criterion:
Oliguria (urine output less than 400 ml per day)

Entity relations:
- Has_value("urine output", "less than 400 ml per day")
- AND("Oliguria", "urine output")